Un hombre de 54 años de edad es diagnosticado de tumor renal izquierdo sugestivo de carcinoma de células renales. En su estudio analítico preoperatorio se detectan niveles elevados de GPT, fosfatasa alcalina y alfa-2-globulina y tiempo de protrombina alargado. El hígado está aumentado de tamaño de forma difusa, pero sin defectos de infiltración hepática. La justificación más probable de estos hallazgos se debe a:
1. Metástasis hepáticas.
2. Trombosis tumoral intrahepática.
3. Hepatitis aguda.
4. Presencia de sustancias hepatotóxicas producidas por el tumor.
5. Hemocromatosis.

Respuesta correcta: 4. Presencia de sustancias hepatotóxicas producidas por el tumor.